Clinical trial exclusion criterion:
Prior treatment with topotecan or gemcitabine.

Annotated entities:
- Drug: "topotecan"
- Drug: "gemcitabine"
- Observation: "treatment"
- Temporal: "Prior"